Clinical trial exclusion criterion:
Antitumor therapy (e.g., chemotherapy, hormonal therapy, immunotherapy, antibody therapy, radiotherapy), or investigational agent or therapy <=30 days before first dose of study treatment or not recovered from any acute toxicity.

Entity relations:
- Subsumes("Antitumor therapy", "chemotherapy")
- Has_index("<=30 days before first dose of study treatment", "first dose of study treatment")
- Has_temporal("Antitumor therapy", "<=30 days before first dose of study treatment")
- OR("chemotherapy", "antibody therapy", "immunotherapy", "hormonal therapy", "radiotherapy")
- OR("Antitumor therapy", "therapy", "investigational agent")
- OR("Antitumor therapy", "not recovered from any acute toxicity")